Clinical trial inclusion criterion:
5. Patients on standard treatment of chronic heart failure at the target dose or maximum tolerance dose for over 1 month ,or unchanged dose in last 1 month;

Entity relations:
- AND("treatment of chronic heart failure", "chronic heart failure")
- Has_temporal("target dose", "for over 1 month")
- Has_temporal("treatment of chronic heart failure", "in last 1 month")
- OR("target dose", "maximum tolerance dose")
- OR("target dose", "unchanged dose")